關於胃食道逆流（Gastroesophageal reflux）與肥厚性幽門狹窄（Hypertrophic pyloric stenosis）之比較，下列何者正確？
A. 胃食道逆流沒有男女性別比的差異，肥厚性幽門狹窄則是女生比男生多
B. 胃食道逆流的嬰兒大多會嚴重影響體重增加，肥厚性幽門狹窄未治療大多會嚴重嘔吐甚至脫水
C. 胃食道逆流嬰兒的嘔吐物多不含膽汁，肥厚性幽門狹窄嬰兒的嘔吐物多含有膽汁
D. 胃食道逆流的嬰兒大多隨年齡增長而自行改善，肥厚性幽門狹窄嬰兒確診後需要手術或藥物治療

正確答案：D. 胃食道逆流的嬰兒大多隨年齡增長而自行改善，肥厚性幽門狹窄嬰兒確診後需要手術或藥物治療